History of seizures

The above is a clinical trial exclusion criterion. Annotated with entity spans:
History of [Condition: seizures]